Las reacciones químicas del proceso de corte y empalme de los intrones durante la maduración de los pre-mRNAs consiste en::
1. Una reacción de oxido-reducción.
2. Una reacción de transesterificación.
3. Dos reacciones de transesterificación secuenciales.
4. Tres reacciones de transesterificación secuenciales.
5. Una reacción de transesterificación seguida de otra de oxidación.

Respuesta correcta: 3. Dos reacciones de transesterificación secuenciales.